Has an active infection requiring systemic therapy

The above is a clinical trial exclusion criterion. Annotated with entity spans:
Has an [Temporal: active] [Condition: infection] [Qualifier: requiring systemic therapy]